Clinical trial exclusion criterion:
Existing a second malignancy within 5 years

Entity relations:
- Has_temporal("second malignancy", "within 5 years")